Clinical trial inclusion criteria:
All infertile women treated with intracytoplasmic sperm injection (ICSI)/Fertilization in Vitro and Embryo Transfer (FIVET)
Less than or equal to (<=) 1 previous failed embryo transfer
Eumenorrheic normo-gonadotropic women
Basal follicle-stimulating hormone (FSH) <=12 International unit per liter (IU/L)
Anti-mullerian hormone (AMH) greater than (>) 1.1 nanogram per milliliter (ng/mL)
Ovarian Reserve: number of antral follicles 2 millimeter (mm) between 6 <= antral follicle count (AFC) <= 16
Follicles > 16 mm at the triggering day between 5-14
Body Mass Index (BMI) between 18 <= BMI <= 27 kilogram per meter square (kg/m^2)
Indication for Fresh Embryo transfer
Normal uterine cavity on ultrasound exam (e.g., no presence of hydrosalpinx)
Undergoing Assisted Reproductive Technique (ART) and oocyte maturation by human chorionic gonadotropin (HCG) triggering
Progesterone (P4) serum level at the HCG triggering day <= 1.5 ng/mL (Day O/Randomization)
Estradiol (E2) <= 3000 picogram/milliliter (pg/mL) at the human chorionic gonadotropin (HCG) triggering day (Day 0/Randomization)
Subjects must have read and signed the Informed Consent Form prior to study-specific-procedures not part of standard of care
Other protocol defined inclusion criteria could apply

Annotated entities:
- Condition: "infertile"
- Person: "women"
- Procedure: "intracytoplasmic sperm injection (ICSI)"
- Procedure: "Fertilization in Vitro and Embryo Transfer (FIVET)"
- Value: "Less than or equal to (<=) 1"
- Measurement: "previous failed embryo transfer"
- Condition: "Eumenorrheic"
- Condition: "normo-gonadotropic"
- Person: "women"
- Measurement: "Basal follicle-stimulating hormone (FSH)"
- Value: "<=12 International unit per liter (IU/L)"
- Measurement: "Anti-mullerian hormone (AMH)"
- Value: "greater than (>) 1.1 nanogram per milliliter (ng/mL)"
- Measurement: "number of antral follicles 2 millimeter (mm)"
- Value: "between 6 <= antral follicle count (AFC) <= 16"
- Measurement: "Follicles > 16 mm"
- Value: "between 5-14"
- Temporal: "at the triggering day"
- Measurement: "Body Mass Index (BMI)"
- Value: "between 18 <= BMI <= 27 kilogram per meter square (kg/m^2)"
- Mood: "Indication for"
- Procedure: "Fresh Embryo transfer"
- Procedure: "ultrasound exam"
- Observation: "Normal uterine cavity"
- Negation: "no presence of"
- Condition: "hydrosalpinx"
- Procedure: "Assisted Reproductive Technique (ART)"
- Procedure: "oocyte maturation"
- Procedure: "human chorionic gonadotropin (HCG) triggering"
- Temporal: "Undergoing"
- Measurement: "Progesterone (P4) serum level"
- Temporal: "at the HCG triggering day"
- Reference_point: "the HCG triggering day"
- Value: "<= 1.5 ng/mL"
- Reference_point: "Day O/Randomization"
- Measurement: "Estradiol (E2)"
- Value: "<= 3000 picogram/milliliter (pg/mL)"
- Reference_point: "the human chorionic gonadotropin (HCG) triggering day"
- Temporal: "at the human chorionic gonadotropin (HCG) triggering day"
- Reference_point: "Day 0/Randomization"
- Informed_consent: "Subjects must have read and signed the Informed Consent Form prior to study-specific-procedures not part of standard of care"
- Non-representable: "Other protocol defined inclusion criteria could apply"